age =18 at screening

The above is a clinical trial inclusion criterion. Annotated with entity spans:
[Person: age] [Value: =18] at screening